¿Qué podemos decir de los estudios que pretenden determinar si un tratamiento psicológico produce efectos mensurables en amplias poblaciones de pacientes en su ambiente clínico real?:
1. Son estudios de efectividad.
2. Son estudios que pretenden alcanzar el máximo de validez interna.
3. Son estudios de eficacia.
4. Se caracterizan por la asignación del azar de los pacientes.

Respuesta correcta: 1. Son estudios de efectividad.